Clinical trial inclusion criterion:
HFpEF: physician-confirmed diagnosis of HF, symptomatic HF, LVEF at least 50%, elevated LV filling pressure by catheterization, echocardiographic criteria or B-type-natriuretic peptide > 100, current BP < 160/90

Entity relations:
- Has_qualifier("HF", "symptomatic")
- Has_qualifier("HF", "physician-confirmed")
- Has_value("LVEF", "at least 50%")
- Has_value("LV filling pressure", "elevated")
- AND("catheterization", "LV filling pressure")
- Has_value("B-type-natriuretic peptide", "> 100")
- Has_value("current BP", "< 160/90")
- AND("HFpEF", "HF")
- AND("HFpEF", "HF")
- AND("HFpEF", "LVEF")
- AND("HFpEF", "catheterization")
- AND("HFpEF", "B-type-natriuretic peptide")
- AND("HFpEF", "current BP")